Unwilling or unable to complete the patient reported outcome (PRO) questionnaires

The above is a clinical trial exclusion criterion. Annotated with entity spans:
[Non-representable: Unwilling or unable to complete the patient reported outcome (PRO) questionnaires]